下列何種寄生蟲之感染經常造成腹絞痛、噁心、嘔吐及急性水樣腹瀉，並常伴隨有低蛋白血症、低血鉀及低血鈣等嚴重電解質失衡病症？
A. 旋毛蟲（Trichinella spiralis）
B. 海獸胃線蟲（Anisakis spp.）
C. 菲律賓毛線蟲（Capillaria philippinensis）
D. 棘顎口線蟲（Gnathostoma spinigerum）

正確答案：C. 菲律賓毛線蟲（Capillaria philippinensis）